Clinical trial exclusion criterion:
Evidence of intoxication or withdrawal during the screening evaluation

Entity relations:
- OR("intoxication", "withdrawal")